45 歲李先生主訴最近半年持續右耳閉塞感及聽力減退，但沒有眩暈或耳漏現象。理學檢查發現耳膜完整但顏色為琥珀色，純音聽力檢查為傳導性聽力損傷，下列診斷何種最為可能？
A. 梅尼爾氏症（Meniere's disease）
B. 慢性中耳炎
C. 中耳腔積液
D. 中耳膽脂瘤（cholesteatoma）

正確答案：C. 中耳腔積液